Clinical trial exclusion criterion:
concomitant drug medication; The following drugs cause drug interaction with S-1.

Annotated entities:
- Drug: "medication"
- Drug: "drug"
- Temporal: "concomitant"
- Non-representable: "The following drugs cause drug interaction with S-1."